Clinical trial exclusion criterion:
Antecedent of epileptic seizure

Entity relations:
- Has_temporal("epileptic seizure", "Antecedent")